Clinical trial exclusion criteria:
Secondary hypertension or malignant hypertension
Diabetes mellitus
History or evidence of a stroke
Hepatic or hematologic abnormality
Mild Cognitive Impairment or Dementia
Serum potassium level = 5.5 mEq/L
Serum creatinine level = 3.0 mg/dL
Acute or chronic disease
Allergy to any drugs
Pregnancy

Annotated entities:
- Condition: "Secondary hypertension"
- Condition: "malignant hypertension"
- Condition: "Diabetes mellitus"
- Temporal: "History"
- Mood: "evidence"
- Condition: "stroke"
- Condition: "Hepatic abnormality"
- Condition: "hematologic abnormality"
- Condition: "Mild Cognitive Impairment"
- Condition: "Dementia"
- Measurement: "Serum potassium level"
- Value: "= 5.5 mEq/L"
- Measurement: "Serum creatinine level"
- Value: "= 3.0 mg/dL"
- Condition: "chronic disease"
- Condition: "Acute disease"
- Condition: "Allergy"
- Drug: "any drugs"
- Condition: "Pregnancy"